HbA1c =6.5%

The above is a clinical trial inclusion criterion. Annotated with entity spans:
[Measurement: HbA1c] [Value: =6.5%]